Clinical trial exclusion criterion:
Heart failure or Chronic renal failure

Entity relations:
- OR("Heart failure", "Chronic renal failure")